Clinical trial exclusion criterion:
contra-indications for regular dental treatment

Entity relations:
- AND("contra-indications", "regular dental treatment")